供應小腦後下方之血管直接源自於何動脈？
A. 椎
B. 肺
C. 頸內
D. 大腦下

正確答案：A. 椎